Clinical trial inclusion criterion:
History of positive skin prick test or blood radio-allergosorbent test (RAST) to grass and/or ragweed pollen

Annotated entities:
- Measurement: "skin prick test"
- Value: "positive"
- Measurement: "blood radio-allergosorbent test (RAST)"
- Qualifier: "grass"
- Qualifier: "ragweed pollen"